Clinical trial inclusion criterion:
Currently smoke at least ten cigarettes a day

Entity relations:
- Has_multiplier("smoke", "at least ten cigarettes a day")